Serum erythropoietin <500 milliunits/milliliter (mU/mL) within 14 days prior to the first dose of study treatment

The above is a clinical trial inclusion criterion. Annotated with entity spans:
[Measurement: Serum erythropoietin] [Value: <500 milliunits/milliliter] (mU/mL) [Temporal: within 14 days prior to the first dose of study treatment]